Clinical trial exclusion criterion:
Chronic liver disease and/or screening alanine transaminase (ALT) or aspartate transaminase (AST) above three times the upper limit of the normal range.

Annotated entities:
- Condition: "Chronic liver disease"
- Measurement: "alanine transaminase (ALT)"
- Measurement: "aspartate transaminase (AST)"
- Value: "above three times the upper limit of the normal range"